肱骨在三角肌粗隆（deltoid tuberosity of humerus）位置的骨折，最可能直接傷及那一條血管？
A. 肱骨前迴旋動脈（anterior circumflex humeral artery）
B. 肱骨後迴旋動脈（posterior circumflex humeral artery）
C. 肩胛迴旋動脈（circumflex scapular artery）
D. 肱深動脈（profunda brachii artery）

正確答案：D. 肱深動脈（profunda brachii artery）